下列敘述何者正確？
A. 新生兒胃抽取液超過20 c.c.以上時，應懷疑肺部疾病
B. 新生兒在第一天看到胎便，可排除腸阻塞之可能
C. 約50%十二指腸阻塞的病童，合併染色體異常
D. 胎兒期羊水過多，常是胎兒腎臟疾病造成

正確答案：C. 約50%十二指腸阻塞的病童，合併染色體異常